Age= 18 years and less than 70 years.

The above is a clinical trial inclusion criterion. Annotated with entity spans:
[Person: Age][Value: = 18 years and less than 70 years].